¿Cuál de las siguientes afirmaciones referidas a la hormona de crecimiento es falsa?
1. Su secreción está aumentada durante el sueño.
2. Se secreta por la adenohipófisis.
3. Es un péptido cíclico de 8 aminoácidos.
4. Es hiperglucemiante.
5. Estimula la producción de somatomedinas.

Respuesta correcta: 3. Es un péptido cíclico de 8 aminoácidos.